Según la Organización Mundial de la Salud, la acción ejercida sobre los individuos para llevarles a modificar sus comportamientos, recibe el nombre de:
1. Evaluación del Impacto de Salud.
2. Educación para la Salud.
3. Intervención participativa en Salud.
4. Empoderamiento.
5. Transición Educativa en Salud.

Respuesta correcta: 2. Educación para la Salud.